HIV-1 antibody negative

The above is a clinical trial inclusion criterion. Annotated with entity spans:
[Measurement: HIV-1 antibody] [Value: negative]